Clinical trial exclusion criterion:
diseases/drugs that influence on autonomic nervous system activity

Annotated entities:
- Condition: "diseases"
- Drug: "drugs"
- Qualifier: "influence on autonomic nervous system activity"